Positive for hepatitis B, hepatitis C or HIV infection

The above is a clinical trial exclusion criterion. Annotated with entity spans:
[Value: Positive] for [Measurement: hepatitis B], [Measurement: hepatitis C] or [Condition: HIV infection]